Subjects that have an indwelling CICC and are transitioning to a PICC for long-term IV access

The above is a clinical trial inclusion criterion. Annotated with entity spans:
Subjects that have an [Device: indwelling CICC] and are [Observation: transitioning to a PICC] for long-term IV access